有關判斷是否為皮膚黑色素細胞癌（cutaneous melanoma）的ABCD口訣敘述，下列何者正確？
A. A：不對稱（asymmetry）：病灶左右上下不對稱
B. B：邊緣（border）：規則的邊緣
C. C：顏色（color）：病灶色澤均勻
D. D：直徑（diameter）：小於6 mm時要特別考慮是黑色素細胞癌

正確答案：A. A：不對稱（asymmetry）：病灶左右上下不對稱